What nerve is affected in Carpel Tunnel syndrome?

Carpel tunnel syndrome (CTS) is a condition in which median nerve compression results in paresthesias and pain in the wrist and hand.